Clinical trial exclusion criterion:
Hepatic or hematologic abnormality

Annotated entities:
- Condition: "Hepatic abnormality"
- Condition: "hematologic abnormality"